Which is the major RNA editing enzyme in Drosophila melanogaster?

adar